Clinical trial inclusion criterion:
If entering the study as an inpatient, hospitalization was recent

Annotated entities:
- Visit: "inpatient"
- Visit: "hospitalization"
- Temporal: "recent"